Clinical trial inclusion criterion:
symptoms of menometrorrhagia,

Annotated entities:
- Mood: "symptoms"
- Condition: "menometrorrhagia"